have experienced 1 or more falls in the last month before the study

The above is a clinical trial exclusion criterion. Annotated with entity spans:
have experienced [Multiplier: 1 or more] [Observation: falls] [Temporal: in the last month before the study]